List ribosomal biogenesis proteins.

FGF13
p53
TGFβ/Activin
PTEN
Nucleostemin
HEATR1